contra-indications for regular dental treatment

The above is a clinical trial exclusion criterion. Annotated with entity spans:
[Condition: contra-indications] for [Procedure: regular dental treatment]